下列何者是賽姆氏截肢（Symes amputation）的截肢部位？
A. 大拇指離斷（big toe disarticulation）
B. 經蹠骨截肢（trans-metatarsal amputation）
C. 踝關節離斷（ankle disarticulation）
D. 經脛骨截肢（trans-tibial amputation）

正確答案：C. 踝關節離斷（ankle disarticulation）